¿A cargo de quién estuvo la regulación del ejercicio de las profesiones sanitarias en España durante el siglo XV y posteriores?
1. Las Facultades de Medicina.
2. El Tribunal del Protomedicato.
3. La Junta General de Sanidad.
4. El Ministerio de Educación.
5. La Beneficencia General del Estado.

Respuesta correcta: 2. El Tribunal del Protomedicato.